Clinical trial inclusion criterion:
BMI 30-42

Annotated entities:
- Measurement: "BMI"
- Value: "30-42"